¿Qué tienen en común la artritis reumatoide, el síndrome de Sjögren y el lupus eritematoso sistémico?:
1. Son enfermedades debidas a hipersensibilidad de tipo I (inmediata).
2. Son enfermedades debidas a hipersensibilidad de tipo IV (retardada)
3. Son enfermedades autoinmunes organoespecíficas.
4. Son enfermedades autoinmunes sistémicas.

Respuesta correcta: 4. Son enfermedades autoinmunes sistémicas.